Clinical trial inclusion criterion:
Frequent HAs that started within 3months after a head injury. The HAs either 1) must last 4 or more hours a day and reach a moderate to severe intensity at any point during the headache, or 2) may be of any severity or duration if the participant takes a triptan or ergotamine. HAs meeting these criteria must have been present on average at least 8 days per 4-week period, starting within 30 days after head injury and occurring by self-report for at least 3 months prior to the Initial Screening Visit. The 4-week HA frequency/severity criteria must be confirmed during the Preliminary Screening Period.

Annotated entities:
- Condition: "HAs"
- Qualifier: "Frequent"
- Temporal: "within 3months after a head injury"
- Reference_point: "a head injury"
- Condition: "HAs"
- Multiplier: "last 4 or more hours a day"
- Qualifier: "moderate to severe intensity"
- Drug: "triptan"
- Drug: "ergotamine"
- Multiplier: "at least 8 days per 4-week period"
- Temporal: "within 30 days after head injury"
- Temporal: "at least 3 months prior to the Initial Screening Visit"
- Reference_point: "the Initial Screening Visit"